Clinical trial exclusion criterion:
Severe coagulopathy

Entity relations:
- Has_qualifier("coagulopathy", "Severe")